Clinical trial exclusion criterion:
contraindication against ibuprofen (known or suspected allergy against ibuprofen, anaphylactic reaction against Nonsteroidal anti-inflammatory drugs (NSAID), active or recurrent stomach or duodenal ulcera or bleeding, severe liver or renal insufficiency, inflammatory bowel syndrome, and pregnancy/breastfeeding)

Annotated entities:
- Condition: "contraindication"
- Drug: "ibuprofen"
- Qualifier: "known"
- Qualifier: "suspected"
- Condition: "allergy"
- Drug: "ibuprofen"
- Condition: "anaphylactic reaction"
- Drug: "Nonsteroidal anti-inflammatory drugs (NSAID)"
- Temporal: "active"
- Qualifier: "recurrent"
- Qualifier: "stomach"
- Condition: "bleeding"
- Qualifier: "duodenal"
- Condition: "ulcera"
- Condition: "severe liver insufficiency"
- Condition: "severe renal insufficiency"
- Condition: "inflammatory bowel syndrome"
- Condition: "pregnancy"
- Observation: "breastfeeding"